Baseline hemogram with Hb<10g/dL or PLT count<100,000/μL

The above is a clinical trial exclusion criterion. Annotated with entity spans:
[Temporal: Baseline] [Procedure: hemogram] with [Measurement: Hb][Value: <10g/dL] or [Measurement: PLT count][Value: <100,000/μL]